contraindication for combined antiplatelet treatment

The above is a clinical trial exclusion criterion. Annotated with entity spans:
[Condition: contraindication] for [Procedure: combined antiplatelet treatment]